Subjects age 21 and older

The above is a clinical trial inclusion criterion. Annotated with entity spans:
Subjects [Person: age] [Value: 21 and older]